Clinical trial inclusion criterion:
The participant has received a levodopa combination drug without change in the dose regimen.

Annotated entities:
- Drug: "levodopa combination drug"
- Qualifier: "without change in the dose regimen"